2. C5 to T12 spinal cord injury, classified as ISNCSCI grades C and D

The above is a clinical trial inclusion criterion. Annotated with entity spans:
[Parsing_Error: 2.] [Qualifier: C5 to T12] [Condition: spinal cord injury], classified as [Measurement: ISNCSCI] [Value: grades C and D]